Clinical trial exclusion criterion:
E.coli isolate resistant to pivmecillinam

Entity relations:
- multi("resistant to pivmecillinam", "pivmecillinam")
- Has_qualifier("E.coli isolate", "resistant to pivmecillinam")